下列有關血管的敘述，何者錯誤？
A. 靜脈比動脈有較大的順應性（compliance）
B. 主動脈及其他大動脈可藉由管壁的伸展性，產生壓力暫存（pressure reservoir）的作用
C. 小動脈（arteriole）的血流阻力是可以改變的
D. 全身血液量最主要分布在各微血管床

正確答案：D. 全身血液量最主要分布在各微血管床